一位 20 歲男性，住宿學生，近日發現手指縫、腋下、腹部、大腿內側及陰囊有劇癢性丘疹，於夜晚蓋被時症狀加劇。室友也有同樣之情形。診斷為下列何者？
A. 變色糠疹（pityriasis versicolor）
B. 尋常性痤瘡（acne vulgaris）
C. 蚊蟲咬（insect bite）
D. 疥瘡（scabies）

正確答案：D. 疥瘡（scabies）